對於在進行 Epidural anesthesia 時意外造成 dura puncture 後引發頭痛之處理，下列何者最有效？
A. 加速靜脈輸液（Intravenous fluid）
B. 口服止痛藥
C. 硬脊膜外自體血液凝塊（Epidural blood patch）
D. 硬脊膜外注射 bupivacaine

正確答案：C. 硬脊膜外自體血液凝塊（Epidural blood patch）